Patients with a contraindication to VCE (small bowel strictures, oropharyngeal dysphagia, pregnancy, patients who are not surgical candidates)

The above is a clinical trial exclusion criterion. Annotated with entity spans:
Patients with a [Condition: contraindication] to [Procedure: VCE] ([Condition: small bowel strictures], [Condition: oropharyngeal dysphagia], [Condition: pregnancy], patients who are [Negation: not] [Observation: surgical candidates])